Clinical trial exclusion criterion:
Body Mass Index (BMI) of > 32

Annotated entities:
- Measurement: "Body Mass Index"
- Measurement: "BMI"
- Value: "> 32"